Clinical trial exclusion criterion:
Current or planned psychotherapy

Entity relations:
- Has_temporal("psychotherapy", "Current")
- OR("Current", "planned")